¿Cuál de los fármacos reseñados está contraindicado durante el embarazo?:
1. Atorvastatina.
2. Digoxina.
3. Fosfomicina.
4. Insulina.

Respuesta correcta: 1. Atorvastatina.